Are sensitive to amikacin;

The above is a clinical trial inclusion criterion. Annotated with entity spans:
Are [Condition: sensitive] to [Drug: amikacin];